Clinical trial exclusion criterion:
Repeated episodes of severe hypoglycaemia within the last six months prior to Screening

Annotated entities:
- Multiplier: "Repeated"
- Condition: "severe hypoglycaemia"
- Temporal: "within the last six months prior to Screening"
- Reference_point: "Screening"